Una chica de 18 años sufre una pérdida de conciencia al regresar a su domicilio tras una noche de fiesta sin dormir. Ha notado un breve mareo, la han visto pálida y se ha caído. Ha tenido convulsiones durante unos 10 segundos y se ha orinado. Se recupera en menos de un minuto, orientada y consciente de la situación. Vomita. Cuenta que el año anterior tuvo un cuadro similar. ¿Si usted la atendiera en urgencias, cuál le parece la actitud más adecuada?
1. Pensar en síncope vasovagal y dar el alta.
2. Solicitar un TAC craneal e iniciar tratamiento antiepiléptico.
3. Solicitar analítica y remitirla a consulta del neurólogo.
4. Pensar en intoxicación etílica aguda, hacer TAC craneal y punción lumbar y administrar tiamina IV.

Respuesta correcta: 1. Pensar en síncope vasovagal y dar el alta.